Clinical trial inclusion criterion:
Overweight/Obese Adult patients (age 19 years -65)

Annotated entities:
- Condition: "Overweight"
- Condition: "Obese"
- Person: "Adult"
- Person: "age"
- Value: "19 years -65"